正常情況下，下列何種血漿蛋白主要由肝臟生成？
A. protein C
B. von Willebrand factor（vWF）
C. granulocyte-colony stimulating factor（G-CSF）
D. interferon gamma

正確答案：A. protein C